No hyperfluorescence on ICGA;

The above is a clinical trial exclusion criterion. Annotated with entity spans:
[Negation: No] [Value: hyperfluorescence] on [Measurement: ICGA];